Clinical trial inclusion criterion:
The patient has no child bearing potential

Entity relations:
- Has_negation("child bearing potential", "no")